Clinical trial exclusion criteria:
the child has temperature > 39.0◦C or a severe acute illness as defined by the examining nurse
the child has as a mid upper arm circumference < 110 mm and is older than 6 months (most feasible local indicator of AIDS and chronic immunosuppressive disease)
the child has experienced a severe allergic reaction after previous vaccination, drug or food.
the child is enrolled in an ongoing study of Bacillus Calmette Guerin vaccine and is < 2 months old
For the RECAMP-MV trial: the child is enrolled in RECAMP-OPV

Annotated entities:
- Measurement: "temperature"
- Value: "> 39.0◦C"
- Person: "child"
- Qualifier: "severe"
- Condition: "acute illness"
- Qualifier: "as defined by the examining nurse"
- Person: "child"
- Measurement: "mid upper arm circumference"
- Value: "< 110 mm"
- Value: "is older than 6 months"
- Person: "old"
- Non-representable: "(most feasible local indicator of AIDS and chronic immunosuppressive disease)"
- Person: "child"
- Condition: "severe allergic reaction"
- Temporal: "after previous vaccination, drug or food"
- Reference_point: "previous vaccination, drug or food"
- Procedure: "vaccination"
- Procedure: "drug"
- Procedure: "food"
- Temporal: "previous"
- Competing_trial: "the child is enrolled in an ongoing study of Bacillus Calmette Guerin vaccine and is < 2 months old"
- Observation: "RECAMP-MV trial"
- Observation: "enrolled in RECAMP-OPV"